Clinical trial inclusion criterion:
All patients admitted at the Gynecological emergency Unit at Hospital de Clínicas de Porto Alegre scheduled for uterine evacuation with <12 weeks of gestation.

Entity relations:
- Has_multiplier("gestation", "<12 weeks")
- AND("uterine evacuation", "gestation")